Clinical trial exclusion criterion:
Chronic kidney disease in stages = 4, as defined per National Kidney Foundation (8).

Annotated entities:
- Condition: "Chronic kidney disease"
- Measurement: "stages"
- Value: "= 4"
- Qualifier: "National Kidney Foundation"